下列關於粒線體ATP synthase的敘述，何者錯誤？
A. 位於粒線體內膜
B. 可利用氫離子濃度梯度（H+ gradient）將ADP轉換為ATP
C. 為氫離子與磷酸根之symporter
D. 此酵素運作時會產生蛋白質四級結構變化

正確答案：C. 為氫離子與磷酸根之symporter